What alternate indication has Vanoxerine been repositioned for?

Vanoxerine 's effects were strongly frequency-dependent and we repositioned it for treatment of atrial fibrillation and flutter.